Clinical trial exclusion criterion:
Presence of an AIDS-defining opportunistic infection within 6 months prior to entry. Note: Refer to the A5324 Manual of Operations (MOPS) for the list of AIDS-defining opportunistic infections.

Annotated entities:
- Condition: "AIDS-defining opportunistic infection"
- Temporal: "within 6 months prior to entry"